Clinical trial inclusion criterion:
Males and females 21 years of age or older;

Entity relations:
- Has_value("age", "21 years or older")
- OR("Males", "females")